Clinical trial exclusion criterion:
Other severe coexisting morbidity which, in the investigator's opinion, can prevent the patient from participating in the study.

Entity relations:
- Has_temporal("morbidity", "coexisting")
- AND("morbidity", "in the investigator's opinion, can prevent the patient from participating in the study")